嬰幼兒血管瘤（hemangioma）最好發於下列那一個內臟器官？
A. 腦部
B. 腸道
C. 腎臟
D. 肝臟

正確答案：D. 肝臟